關於第一型多發性內分泌腫瘤（multiple endocrine neoplasia, type 1）的敘述，下列那一項錯誤？
A. 以體染色體顯性遺傳（autosomal dominant trait）為主
B. 最常見的表現為原發性副甲狀腺功能亢進
C. 可能出現不分泌荷爾蒙的腸道胰臟腫瘤（enteropancreatic tumors）
D. 約 20-30%病人有腦下垂體腫瘤，其中以生長激素瘤（GH producing tumor）最常見

正確答案：D. 約 20-30%病人有腦下垂體腫瘤，其中以生長激素瘤（GH producing tumor）最常見